Clinical trial inclusion criterion:
Have a documented diagnosis of persistent asthma, as defined by the National Institutes of Health for at least 3 months prior to the Screening Visit.

Annotated entities:
- Condition: "persistent asthma"
- Qualifier: "as defined by the National Institutes of Health"
- Temporal: "at least 3 months prior to the Screening Visit"
- Reference_point: "Screening Visit"